T2DM: Diagnosed according to the WHO criteria [53].

The above is a clinical trial inclusion criterion. Annotated with entity spans:
[Condition: T2DM]: Diagnosed according to the [Qualifier: WHO criteria] [53].